男性心因性勃起（psychogenic erection）功能的控制神經組織位在何處？
A. 第十胸髓至第二腰髓的體神經
B. 第十胸髓至第二腰髓的交感神經
C. 第二至第四薦腰的體神經
D. 第二至第四薦腰的副交感神經

正確答案：B. 第十胸髓至第二腰髓的交感神經